Clinical trial exclusion criterion:
2. Were taking a lidocaine-containing product that could not be discontinued while receiving lidocaine

Entity relations:
- multi("while receiving lidocaine", "receiving lidocaine")
- AND("receiving lidocaine", "lidocaine")
- Has_qualifier("lidocaine-containing product", "could not be discontinued")